6. A platelet count less than 75,000 cells/mm3 or greater than 700,000 cells/mm3 or a WBC less than 3,000 cells/mm3.

The above is a clinical trial exclusion criterion. Annotated with entity spans:
6. A [Measurement: platelet count] [Value: less than 75,000 cells/mm3] or [Value: greater than 700,000 cells/mm3] or a [Measurement: WBC] [Value: less than 3,000 cells/mm3].